have a positive pregnancy test at screening, or

The above is a clinical trial exclusion criterion. Annotated with entity spans:
[Pregnancy_considerations: have a positive pregnancy test at screening], or